下列有關腹腔鏡手術中，因 pneumoperitoneum 所產生的 physiological effects 及 potential clinical outcome 的敘述，何者正確？
A. 會降低 intracranial pressure 而造成 central perfusion pressure 的上升
B. 會降低 renal blood flow 而造成 urine output 的下降
C. 會減弱 sympathetic response 而增加 ileus 的情況
D. 會降低 CVP（central venous pressure）及降低 CWP（capillary wedge pressure）而降低 cardiac work

正確答案：B. 會降低 renal blood flow 而造成 urine output 的下降